Clinical trial exclusion criterion:
Any lung surgery within the past two years.

Entity relations:
- Has_temporal("lung surgery", "within the past two years")